Diagnosis of sacroiliitis

The above is a clinical trial inclusion criterion. Annotated with entity spans:
Diagnosis of [Condition: sacroiliitis]